Clinical trial exclusion criterion:
Unable to consent

Annotated entities:
- Post-eligibility: "Unable to consent"